Clinical trial exclusion criterion:
3. Are physically unable to sit upright and still for 40 minutes

Annotated entities:
- Condition: "physically unable to sit upright and still"
- Multiplier: "for 40 minutes"